Clinical trial inclusion criterion:
Critical limb ischemia (Rutherford category 4 or 5)

Entity relations:
- Has_qualifier("limb ischemia", "Critical")
- Has_value("Rutherford category", "4 or 5")
- Subsumes("Critical", "Rutherford category")